Normal liver function (defined as aspartate aminotransferase 10-40 U/L and alanine aminotransferase 7-56 U/L)

The above is a clinical trial inclusion criterion. Annotated with entity spans:
[Condition: Normal liver function] (defined as [Measurement: aspartate aminotransferase] [Value: 10-40 U/L] and [Measurement: alanine aminotransferase] [Value: 7-56 U/L])